Clinical trial exclusion criterion:
Concurrent treatment with a 5-a-reductase inhibitor

Annotated entities:
- Drug: "5-a-reductase inhibitor"